有關脂質代謝之敘述，下列何者錯誤？
A. 腸道所吸收的脂肪，經腸細胞組成乳糜微粒（chylomicron）後，進入乳糜小管
B. 分解血液中之三酸甘油脂的酶，是荷爾蒙敏感性脂肪酶（hormone-sensitive lipase）
C. 低密度脂蛋白（LDL）是由血液中的極低密度脂蛋白（VLDL）轉化而成
D. 高密度脂蛋白（HDL）可以和其他血中的脂蛋白進行脂質交換

正確答案：B. 分解血液中之三酸甘油脂的酶，是荷爾蒙敏感性脂肪酶（hormone-sensitive lipase）